any contraindication for magnetic resonance imaging (MRI)

The above is a clinical trial exclusion criterion. Annotated with entity spans:
any [Condition: contraindication] for [Procedure: magnetic resonance imaging] ([Procedure: MRI])